En cromatografía de gases, ¿de qué tipo son las columnas capilares conocidas como WCOT?:
1. Son columnas abiertas recubiertas con tierra de diatomeas.
2. Son columnas de pared interna revestida.
3. No llevan relleno. Son de pared interna de sílice.
4. Son columnas empaquetadas.

Respuesta correcta: 2. Son columnas de pared interna revestida.